Women who received chemotherapy for other disease entity in recent 1 year.

The above is a clinical trial exclusion criterion. Annotated with entity spans:
Women who received [Procedure: chemotherapy] for other disease entity in [Temporal: recent 1 year].